Patient has a history of bleeding diathesis or coagulopathy or will refuse blood transfusions

The above is a clinical trial inclusion criterion. Annotated with entity spans:
Patient has a history of [Condition: bleeding diathesis] or [Condition: coagulopathy] or [Mood: will refuse] [Procedure: blood transfusions]